新生兒出生後，發現腹腔內臟突出，並有一層薄膜覆蓋包住並與臍帶相連，最有可能的診斷為何？
A. 臍膨出（omphalocele）
B. 腹裂（gastroschisis）
C. 臍疝氣（umbilical hernia）
D. 臍肉芽腫（umbilical granuloma）

正確答案：A. 臍膨出（omphalocele）